Clinical trial inclusion criterion:
Anticipated ventilation of =72 hours at the time of screening, as per the ICU physician.

Entity relations:
- Has_mood("ventilation", "Anticipated")
- Has_temporal("ventilation", "=72 hours")